Clinical trial inclusion criterion:
Normal hormonal investigation: TSH, PRL, FBS.

Annotated entities:
- Procedure: "hormonal investigation:"
- Value: "Normal"
- Measurement: "TSH"
- Measurement: "PRL"
- Measurement: "FBS"